What is the genetic basis of tuberous sclerosis?

The genetic basis of this disease has been attributed to mutations in one of two unlinked genes, TSC1 and TSC2.